Clinical trial exclusion criterion:
Age less than 18 years

Entity relations:
- Has_value("Age", "less than 18 year")